Clinical trial exclusion criterion:
Use of acetylsalicylic acid (ASA), antiplatelet agents within 7 days prior to surgery

Annotated entities:
- Drug: "acetylsalicylic acid"
- Drug: "ASA"
- Drug: "antiplatelet agents"
- Temporal: "within 7 days prior to surgery"
- Reference_point: "surgery"